下列何者不是最近職場上最常見的職業累積性傷害病變（cumulative trauma disorder）危害因子？
A. 重覆性動作（repetitiveness）
B. 高施力動作（forceful exertion）
C. 噪音（noise）
D. 固定姿勢（sustained posture）

正確答案：C. 噪音（noise）